acute narrow angle glaucoma

The above is a clinical trial exclusion criterion. Annotated with entity spans:
[Qualifier: acute] [Condition: narrow angle glaucoma]